Clinical trial exclusion criterion:
History of post-abortion complication or infection

Entity relations:
- Has_temporal("post-abortion complication", "History")
- OR("post-abortion complication", "post-abortion infection")